下列關於促腎上腺皮質激素（adrenocorticotropic hormone, ACTH）和腎上腺皮質醇（cortisol）的分泌特性之敘述，何者錯誤？
A. 兩者分泌均會隨晝夜生物時鐘（circadian rhythm）而改變
B. 每日皮質醇產生量最多的時間主要是在入夜睡眠時間
C. 調控促腎上腺皮質激素分泌晝夜變化主要部位在下視丘的suprachiasmatic nuclei
D. 皮質醇的分泌主要受到促腎上腺皮質激素的分泌變化所調控

正確答案：B. 每日皮質醇產生量最多的時間主要是在入夜睡眠時間